Clinical trial inclusion criterion:
Age greater than or equal to 18 years of age

Annotated entities:
- Person: "Age"
- Value: "greater than or equal to 18 years"